Measurable metastatic disease

The above is a clinical trial inclusion criterion. Annotated with entity spans:
[Qualifier: Measurable] [Condition: metastatic disease]